Clinical trial inclusion criterion:
Major spine surgery scheduled as part of clinical care

Annotated entities:
- Procedure: "Major spine surgery"